百日咳（whooping cough）致病菌具下列何種特徵？
A. 生長於無氧環境中
B. 不產生任何外毒素
C. 無法長久生存於環境中
D. 以昆蟲作為傳播媒介

正確答案：C. 無法長久生存於環境中